Clinical trial inclusion criterion:
Smoked at least 100 cigarettes in lifetime

Annotated entities:
- Observation: "Smoked"
- Multiplier: "at least 100 cigarettes"